有一中年男性，抽菸 10 年，主訴慢性咳嗽，病理組織顯示支氣管上皮為鱗狀上皮，此變化最可能是：
A. 萎縮（atrophy）
B. 化生（metaplasia）
C. 異生（dysplasia）
D. 癌症（cancer）

正確答案：B. 化生（metaplasia）